Clinical trial exclusion criterion:
benzodiazepines

Annotated entities:
- Drug: "benzodiazepines"